Clinical trial exclusion criterion:
Significant motor complication affecting daily activities

Annotated entities:
- Condition: "motor complication"
- Qualifier: "Significant"